有關糖尿病的分類、診斷與病因，下列敘述何者最正確？
A. 第1型糖尿病好發於30歲以上，與自體免疫有關
B. 空腹血糖超過100 mg/dL或HbA1c超過6%即達糖尿病診斷標準
C. 第2型糖尿病與肥胖及家族遺傳有關，是臨床上最常見的糖尿病型態
D. 妊娠型糖尿病好發於婦女懷孕的前3個月，與胰島素阻抗有關

正確答案：C. 第2型糖尿病與肥胖及家族遺傳有關，是臨床上最常見的糖尿病型態